Must provide informed consent and agree to comply with the trial protocol

The above is a clinical trial inclusion criterion. Annotated with entity spans:
[Informed_consent: Must provide informed consent and agree to comply with the trial protocol]